Clinical trial inclusion criterion:
natalizumab,

Annotated entities:
- Drug: "natalizumab"